Clinical trial inclusion criterion:
HIV-1 infected males or females

Entity relations:
- OR("males", "females")